Clinical trial exclusion criterion:
undergoing elective posterior spine single-level instrumentation surgery

Entity relations:
- Has_qualifier("single-level instrumentation surgery", "posterior spine")
- Has_qualifier("single-level instrumentation surgery", "elective")
- Has_temporal("single-level instrumentation surgery", "undergoing")